Population control :

The above is a clinical trial inclusion criterion. Annotated with entity spans:
[Not_a_criteria: Population control :]